Maximum one of the following SIRS criteria (* T>38 ºC or <36ºC, L>12,000 or <4000/uL, HR>90 bpm, RR<20 rpm) or CRP>15 mg/dL

The above is a clinical trial inclusion criterion. Annotated with entity spans:
Maximum one of the following [Measurement: SIRS criteria] (* [Measurement: T][Value: >38 ºC] or [Value: <36ºC], [Measurement: L][Value: >12,000] or [Value: <4000/uL], [Measurement: HR][Value: >90 bpm], [Measurement: RR][Value: <20 rpm]) or [Measurement: CRP][Value: >15 mg/dL]